Scheduled for bilateral varus rotational osteotomy (VRO) with or without associated soft tissue and osseous procedures

The above is a clinical trial inclusion criterion. Annotated with entity spans:
[Mood: Scheduled for] [Qualifier: bilateral] [Procedure: varus rotational osteotomy] ([Procedure: VRO]) with or without associated soft tissue and [Procedure: osseous procedures]